某小學生智力測驗結果智商介於 58～62 之間，功課不佳但與同學互動尚可，經訓練也學會游泳，在家尚可協助掃地與處理垃圾。此生可能的智力發展障礙（mental retardation）等級為：
A. 輕度
B. 中度
C. 重度
D. 無智力障礙

正確答案：A. 輕度